Clinical trial exclusion criterion:
Having undergone lung surgery (e.g. lung resection including lung volume reduction surgery, lung transplant) or subjects scheduled for surgery.

Entity relations:
- Subsumes("lung surgery", "lung resection")
- AND("scheduled", "surgery")
- Subsumes("lung resection", "lung volume reduction surgery")
- OR("lung volume reduction surgery", "lung transplant")
- OR("lung surgery", "surgery")